Clinical trial exclusion criterion:
Presence of another vaginal infection or STD

Entity relations:
- Has_qualifier("vaginal infection", "another")
- OR("vaginal infection", "STD")